Clinical trial exclusion criterion:
Previous history of ovarian surgery or surgical removal of one ovary.

Entity relations:
- Has_multiplier("ovary", "one")
- Has_qualifier("surgical removal", "ovary")
- OR("ovarian surgery", "surgical removal")